Thrombosis extending into the porta(thrombosis of one of left or right branch authorized), extra hepatic metastasis

The above is a clinical trial exclusion criterion. Annotated with entity spans:
[Condition: Thrombosis] [Qualifier: extending into the porta]([Condition: thrombosis] of one of [Qualifier: left] or [Qualifier: right branch] [Grammar_Error: authorized]), [Condition: extra hepatic metastasis]